Clinical trial inclusion criterion:
Participants with low serum testosterone concentrations (< 300 ng/dL) who exhibit at least one sign or symptom of hypogonadism and have evidence of cardiovascular (CV) disease or are at an increased risk for CV disease.

Entity relations:
- Subsumes("low", "< 300 ng/dL")
- Has_value("serum testosterone concentrations", "low")
- Has_multiplier("sign", "at least one")
- AND("sign", "hypogonadism")
- Has_mood("cardiovascular (CV) disease", "evidence of")
- Has_mood("CV disease", "increased risk")
- OR("sign", "symptom")
- OR("cardiovascular (CV) disease", "CV disease")